What is MRSA?

Methicillin resistant Staphylococcus aureus (MRSA) has become a severe health concern because of its treatment difficulties.